下列敘述何者與激素間的允許作用（permissive action）最不相關？
A. 糖皮質素（glucocorticoids）的存在對於升血糖素（glucagon）執行產熱作用（calorigenic effect）
B. 生長激素的存在對腎上腺素執行肝糖分解作用（glycogenolysis）
C. 甲狀腺素的存在對於腎上腺素執行脂解作用
D. 糖皮質素（glucocorticoids）的存在對於腎上腺素執行產熱作用（calorigenic effect）

正確答案：B. 生長激素的存在對腎上腺素執行肝糖分解作用（glycogenolysis）